Current PTSD diagnosis

The above is a clinical trial inclusion criterion. Annotated with entity spans:
[Temporal: Current] [Condition: PTSD] diagnosis